有關心室中膈缺損（VSD）的敘述，下列何者錯誤？
A. 第二型（膜型）的心室中膈缺損可能自然癒合
B. 第一型（室上嵴型）的心室中膈缺損易造成主動脈瓣膜脫垂
C. 東方民族其第一型（室上嵴型）心室中膈缺損的發生率比第二型（膜型）高
D. 部分第二型（膜型）的心室中膈缺損日後會合併肺動脈瓣下狹窄

正確答案：C. 東方民族其第一型（室上嵴型）心室中膈缺損的發生率比第二型（膜型）高